Clinical trial inclusion criterion:
Interested in quitting smoking

Annotated entities:
- Mood: "Interested"
- Observation: "quitting smoking"
- Post-eligibility: "Interested in quitting smoking"